Clinical trial inclusion criterion:
Known history of Type 2 diabetes mellitus for >3 months

Entity relations:
- Has_value("Type 2 diabetes mellitus", ">3 months")